Clinical trial exclusion criterion:
Child Pugh class B or C

Annotated entities:
- Measurement: "Child Pugh class"
- Value: "B or C"